Emergency cases as determined by the investigator or physician

The above is a clinical trial exclusion criterion. Annotated with entity spans:
[Non-query-able: Emergency cases as determined by the investigator or physician]